子宮頸環紮術（如：McDonald cerclage）為治療子宮頸閉鎖不全的方法之一。當接受子宮頸環紮術 週孕婦，出現有感染的情況（如：發燒、腹痛、陰道分泌物增加）時，下列何者為最適宜的處理方式？
A. 給予靜脈注射抗生素及臥床休息（intravenous antimicrobial agents and bed rest）
B. 移除子宮頸環紮並催產（cerclage removal and labor induction）
C. 給予靜脈注射抗生素及安胎藥物（intravenous antimicrobial agents and tocolytic administration）
D. 口服安胎藥物並接受超音波檢查（oral tocolytic drugs and serial ultrasonographic examinations）

正確答案：B. 移除子宮頸環紮並催產（cerclage removal and labor induction）